Clinical trial inclusion criterion:
18years to 65years

Annotated entities:
- Value: "18years to 65years"
- Person: "years"